Developed HBeAg seroconversion (HBeAg negative and ant-HBe negative) with undetectable HBV DNA by PCR based assay on NA treatment.

The above is a clinical trial inclusion criterion. Annotated with entity spans:
Developed [Measurement: HBeAg] [Value: seroconversion] ([Measurement: HBeAg] [Value: negative] and [Measurement: ant-HBe] [Value: negative]) with [Value: undetectable] [Measurement: HBV DNA] by [Procedure: PCR based assay] on [Drug: NA] [Procedure: treatment].